一位 2 歲大之女童，患有長期膽汁鬱滯（cholestasis）。理學檢查發現其營養不良並疑似缺乏某些營養素。下列何種臨床表徵最可能出現於此病例？
A. 懼光（photophobia）
B. 軟骨病（rickets）
C. 神經炎（neuritis）
D. 缺鐵性貧血（iron deficiency anemia）

正確答案：B. 軟骨病（rickets）